Age: >=40 and <=80 years of age at Screening (Visit 1).

The above is a clinical trial inclusion criterion. Annotated with entity spans:
[Person: Age]: [Value: >=40 and <=80 years] of [Person: age] [Temporal: at Screening] (Visit 1).